Which X chromosome abnormalities present lupus-like symptoms?

X-chromosome abnormalities (Tlr7 and Y) present lupus-like symptoms.